Pregnant or lactating women.

The above is a clinical trial inclusion criterion. Annotated with entity spans:
[Condition: Pregnant] or [Condition: lactating] [Person: women].